Clinical trial inclusion criterion:
aged 18-65 years old.

Entity relations:
- Has_value("aged", "18-65 years old")